Female planning to become pregnant or planning to discontinue contraceptive precautions.

The above is a clinical trial exclusion criterion. Annotated with entity spans:
[Person: Female] [Mood: planning to become pregnant] or [Mood: planning to discontinue] [Observation: contraceptive precautions].